妊娠 40 週時，胎兒大腿骨之發育，以超音波測量，何者為正常範圍內之數值？
A. 3.5 mm
B. 7.0 mm
C. 35 mm
D. 70 mm

正確答案：D. 70 mm